胃內氣體的成分中，濃度最高者為何？
A. 氫
B. 氧
C. 氮
D. 二氧化碳

正確答案：C. 氮